Unexplained bleeding from the genital tract

The above is a clinical trial exclusion criterion. Annotated with entity spans:
[Condition: Unexplained bleeding] from the [Qualifier: genital tract]